Clinical trial inclusion criterion:
2.6mmol/L (100mg/dl)=LDL-C=5.2mmol/L (200mg/dl), and TG<5.7mmol/L (500mg/dl);

Annotated entities:
- Value: "2.6mmol/L"
- Value: "100mg/dl"
- Measurement: "LDL-C"
- Value: "5.2mmol/L"
- Value: "200mg/dl"
- Measurement: "TG"
- Value: "<5.7mmol/L"
- Value: "500mg/dl"